Aged 25-80 at screening. Subjects older than 80 will be allowed at the discretion of the PI.

The above is a clinical trial inclusion criterion. Annotated with entity spans:
[Person: Aged] [Value: 25-80] at screening. [Non-query-able: Subjects older than 80 will be allowed at the discretion of the PI].